Clinical trial inclusion criterion:
No previous history of upper gastrointestinal bleeding

Annotated entities:
- Negation: "No"
- Condition: "upper gastrointestinal bleeding"